Clinical trial inclusion criterion:
Adequate hematological, hepatic, and renal function

Annotated entities:
- Qualifier: "Adequate"
- Measurement: "renal function"
- Measurement: "hepatic function"
- Measurement: "hematological function"